Clinical trial inclusion criteria:
Single unit implant rehabilitation
Maxilla and mandible
Must accept treatment plan
Must sign informed consent
dental extraction performed at least 3 month prior
Must have at least 6 mm of residual bone
Absence of oral lesions
keratinized tissue must be present

Annotated entities:
- Procedure: "Single unit implant rehabilitation"
- Qualifier: "Maxilla"
- Qualifier: "mandible"
- Informed_consent: "Must accept treatment plan"
- Informed_consent: "Must sign informed consent"
- Procedure: "dental extraction"
- Temporal: "at least 3 month prior"
- Value: "at least 6 mm"
- Measurement: "residual bone"
- Negation: "Absence"
- Condition: "oral lesions"
- Condition: "keratinized tissue must be present"